Participants who have been treated with testosterone in the past 6 months and for whom testosterone therapy is contraindicated

The above is a clinical trial exclusion criterion. Annotated with entity spans:
Participants who have been treated with [Drug: testosterone] [Temporal: in the past 6 months] and for whom [Procedure: testosterone therapy] is [Condition: contraindicated]